Serum creatinine =1.5 mg/dl or eGFR=60(ml/min/1.73 m2)

The above is a clinical trial inclusion criterion. Annotated with entity spans:
[Measurement: Serum creatinine] [Value: =1.5 mg/dl] or [Measurement: eGFR][Value: =60(ml/min/1.73 m2)]